Artificial heart valves requiring treatment with an anticoagulant

The above is a clinical trial exclusion criterion. Annotated with entity spans:
[Device: Artificial heart valves] requiring treatment with an [Drug: anticoagulant]